Clinical trial exclusion criterion:
Acute infections within the last four weeks prior to Screening

Entity relations:
- Has_index("within the last four weeks prior to Screening", "Screening")
- Has_temporal("Acute infections", "within the last four weeks prior to Screening")